With the history of cognitive disorders

The above is a clinical trial exclusion criterion. Annotated with entity spans:
With the history of [Condition: cognitive disorders]